有關肝臟疾病，下列敘述何者錯誤？
A. 黃麴毒素（aflatoxin）是肝細胞癌的危險因子
B. 結節性再生性增生（nodular regenerative hyperplasia）中央有星狀的纖維化區域
C. 肝腺瘤（hepatic adenoma）可能破裂，造成腹腔內出血
D. 肝母細胞瘤（hepatoblastoma）可出現間質分化（mesenchymal differentiation），例如類骨質，橫紋肌，軟骨等成分

正確答案：B. 結節性再生性增生（nodular regenerative hyperplasia）中央有星狀的纖維化區域